Clinical trial inclusion criteria:
patients who need suturing for laceration under procedural anesthesia using ketamine

Annotated entities:
- Procedure: "suturing"
- Condition: "laceration"
- Procedure: "procedural anesthesia"
- Drug: "ketamine"